Un reforzador negativo tiene como fin:
1. La reducción de la frecuencia de una conducta no deseada.
2. La eliminación de una conducta.
3. El moldeamiento de una conducta compleja.
4. La promoción de nuevas conductas o el fortalecimiento de una conducta ya existente.

Respuesta correcta: 4. La promoción de nuevas conductas o el fortalecimiento de una conducta ya existente.